Desire/intent to become pregnant over the course of the study

The above is a clinical trial exclusion criterion. Annotated with entity spans:
[Observation: Desire/intent to become pregnant] [Temporal: over the course of the study]